Which residue of alpha-synuclein was found to be phosphorylated in Lewy bodies?

Alpha-synuclein phosphorylated at serine 129 (S129) is highly elevated in Parkinson s disease patients where it mainly accumulates in the Lewy bodies